Clinical trial exclusion criterion:
Severe deformity (varus or values from mechanical axis more than 5 degrees

Entity relations:
- Has_qualifier("deformity", "Severe")
- Has_value("values from mechanical axis", "more than 5 degrees")
- Subsumes("deformity", "varus")
- OR("varus", "values from mechanical axis")